Cirrhosis hepatis (Child B or higher)

The above is a clinical trial exclusion criterion. Annotated with entity spans:
[Condition: Cirrhosis hepatis] ([Qualifier: Child B or higher])